Clinical trial exclusion criterion:
Stented lesion

Entity relations:
- AND("lesion", "Stented")